下列有關治療多	症手術的敘述，何者錯誤？
A. 手掌及腋下多	可透過胸腔交感神經切除術改善
B. 手術切除的主要部位是第四及第五胸交感神經節
C. 可能副作用中的Horner's syndrome原因是將T1交感神經節切除
D. 可能的副作用包括血胸及氣胸

正確答案：B. 手術切除的主要部位是第四及第五胸交感神經節